一位8歲兒童被熱水燙傷手臂，紅腫起水泡，非常疼痛，他最有可能為第幾度灼傷？
A. 一度
B. 二度
C. 三度
D. 四度

正確答案：B. 二度